Above 18 years of age

The above is a clinical trial inclusion criterion. Annotated with entity spans:
[Value: Above 18 years] of [Person: age]